rearthroplasty

The above is a clinical trial exclusion criterion. Annotated with entity spans:
[Procedure: rearthroplasty]